Clinical trial inclusion criterion:
Recently diagnosed type 2 diabetic patients.

Entity relations:
- Has_temporal("type 2 diabetic", "Recently diagnosed")